current self-medication with UU preparations e.g. z.B. Cystinol®, Uvalysat®, Arctuvan®

The above is a clinical trial exclusion criterion. Annotated with entity spans:
current [Qualifier: self-medication] with [Drug: UU preparations] e.g. [Drug: z.B. Cystinol®], [Drug: Uvalysat®], [Drug: Arctuvan®]